Clinical trial exclusion criterion:
The participant has a Mini-Mental State Examinations (MMSE) score of <= 24. psychiatric disease.

Annotated entities:
- Measurement: "Mini-Mental State Examinations (MMSE)"
- Value: "<= 24"
- Condition: "psychiatric disease"
- Parsing_Error: "The participant has a Mini-Mental State Examinations (MMSE) score of <= 24. psychiatric disease."